Clinical trial exclusion criterion:
Participation in any other therapeutic drug study within 60 days preceding inclusion.

Annotated entities:
- Competing_trial: "Participation in any other therapeutic drug study within 60 days preceding inclusion."